Clinical trial inclusion criterion:
Age >18 years.

Entity relations:
- Has_value("Age", ">18 years")